Clinical trial exclusion criterion:
Previous hyaluronic acid injection within 6 months

Annotated entities:
- Drug: "hyaluronic acid"
- Procedure: "hyaluronic acid injection"
- Temporal: "within 6 months"
- Temporal: "Previous"